Clinical trial exclusion criterion:
Subject with a history of syncope within the last 6 months prior to screening

Annotated entities:
- Condition: "syncope"
- Temporal: "within the last 6 months prior to screening"
- Reference_point: "screening"